Clinical trial inclusion criteria:
Aged 18 years or older
Scheduled for invasive coronary angiography

Annotated entities:
- Person: "Aged"
- Value: "18 years or older"
- Procedure: "invasive coronary angiography"
- Mood: "Scheduled"